Which lncRNAs are induced by heatshock?

Malat1, papas, long noncoding rnas, circrna, neat1, and mirna are induced by heat shock.